Lumpy or hard stools in =25% of defecations

The above is a clinical trial inclusion criterion. Annotated with entity spans:
[Observation: Lumpy] or [Observation: hard stools] in [Multiplier: =25%] of [Condition: defecations]